Resting functional residual capacity (FRC) >120% predicted;

The above is a clinical trial inclusion criterion. Annotated with entity spans:
[Measurement: Resting functional residual capacity (FRC)] [Value: >120% predicted];